Clinical trial exclusion criterion:
definite radiographic evidence of osteoarthritis of the glenohumeral joint

Annotated entities:
- Mood: "radiographic evidence"
- Condition: "osteoarthritis"
- Qualifier: "glenohumeral joint"
- Procedure: "radiographic"
- Qualifier: "definite"